2. Patient has a diagnosis of bowel obstruction, bowel strangulation, peritonitis, bowel perforation, local or systemic infection, ischemic bowel, carcinomatosis or extensively spread inflammatory bowel disease.

The above is a clinical trial exclusion criterion. Annotated with entity spans:
2. Patient has a diagnosis of [Condition: bowel obstruction], [Condition: bowel strangulation], [Condition: peritonitis], [Condition: bowel perforation], [Condition: local] or [Condition: systemic infection], [Condition: ischemic bowel], [Condition: carcinomatosis] or [Qualifier: extensively spread] [Condition: inflammatory bowel disease].